El producto principal de la reacción de la mononitración del 1-isopropil-3-metilbenceno con ácido nítrico y sulfúrico es:
1. 4-isopropil-2-metil-1-nitrobenceno.
2. 2- isopropil-4-metil-1-nitrobenceno.
3. 1-isopropil-3-metil-2-nitrobenceno.
4. 1-isopropil-3-metil-5-nitrobenceno.

Respuesta correcta: 1. 4-isopropil-2-metil-1-nitrobenceno.